Clinical trial exclusion criterion:
Additional congenital gastrointestinal abnormalities requiring surgical intervention

Entity relations:
- Has_qualifier("gastrointestinal abnormalities", "Additional")
- Has_mood("surgical intervention", "requiring")
- AND("gastrointestinal abnormalities", "surgical intervention")
- Has_qualifier("gastrointestinal abnormalities", "congenital")